Clinical trial exclusion criterion:
History of cardiogenic shock

Annotated entities:
- Condition: "cardiogenic shock"
- Temporal: "History"